¿Qué nombre le damos al continuo incremento de la restricción calórica que se requiere en la dieta para seguir perdiendo peso?:
1. Efecto suelo de las dietas.
2. Efecto techo de las dietas.
3. Setpoint.
4. Mantenimiento autoimpuesto.
5. Efecto de resistencia.

Respuesta correcta: 1. Efecto suelo de las dietas.